Clinical trial inclusion criterion:
Female subjects of non-childbearing potential may be enrolled in the study. Non-childbearing potential is defined as pre-menarche, current bilateral tubal ligation or occlusion, hysterectomy, bilateral ovariectomy or post-menopause.

Annotated entities:
- Person: "Female"
- Negation: "non-"
- Observation: "childbearing potential"
- Observation: "pre-menarche"
- Temporal: "current"
- Condition: "bilateral tubal ligation"
- Condition: "bilateral tubal occlusion"
- Condition: "hysterectomy"
- Procedure: "bilateral tubal ligation"
- Procedure: "bilateral tubal occlusion"
- Condition: "bilateral ovariectomy"
- Observation: "post-menopause"
- Procedure: "bilateral ovariectomy"